Clinical trial inclusion criteria:
Accident & Emergency Department patients, requiring parenteral drug sedation (as determined by an emergency clinician) will be enrolled.

Annotated entities:
- Visit: "Accident & Emergency Department"
- Procedure: "parenteral drug sedation"
- Mood: "requiring"